14. History of obstructive sleep apnea.

The above is a clinical trial exclusion criterion. Annotated with entity spans:
[Parsing_Error: 14.] [Temporal: History] of [Condition: obstructive sleep apnea].